Any prior serious adverse reaction or hypersensitivity to fentanyl, morphine, codeine, hydrocodone, hydromorphone, oxycodone, oxymorphone, naltrexone or naloxone or any of the inactive ingredients in the TDDS (polyester/ethyl vinyl acetate, polyacrylate adhesive, silicone adhesive, dimethicone NF, or polyolefin)

The above is a clinical trial exclusion criterion. Annotated with entity spans:
Any prior serious adverse reaction or [Condition: hypersensitivity] to [Drug: fentanyl], [Drug: morphine], [Drug: codeine], [Drug: hydrocodone], [Drug: hydromorphone], [Drug: oxycodone], [Drug: oxymorphone], [Drug: naltrexone] or [Drug: naloxone] or any of the inactive ingredients in the [Device: TDDS] ([Device: polyester/ethyl vinyl acetate], [Device: polyacrylate adhesive], [Device: silicone adhesive], [Device: dimethicone NF], or [Device: polyolefin])